Arterial disease (ABPI<0.8)

The above is a clinical trial exclusion criterion. Annotated with entity spans:
[Condition: Arterial disease] ([Measurement: ABPI][Value: <0.8])